Clinical trial exclusion criterion:
Decompensated heart failure or hemodynamic instability

Entity relations:
- Has_qualifier("heart failure", "Decompensated")
- OR("heart failure", "hemodynamic instability")